Clinical trial exclusion criterion:
Active tumor treated at the time of inclusion associated with expected survival less than one year

Entity relations:
- multi("Active", "Active")
- Has_temporal("treated", "at the time of inclusion")
- Has_qualifier("tumor", "Active")
- AND("treated", "tumor")
- Has_value("expected survival", "less than one year")
- AND("tumor", "expected survival")